La secreción de GH:
1. Cesa tras la pubertad.
2. Aumenta durante el ayuno.
3. Disminuye durante el sueño.
4. Es estimulada por la somatostatina.
5. Es inhibida por el ejercicio.

Respuesta correcta: 2. Aumenta durante el ayuno.